Clinical trial exclusion criterion:
History of curettage or other intrauterine surgery

Annotated entities:
- Procedure: "curettage"
- Temporal: "History"
- Procedure: "intrauterine surgery"